Positive urine toxicology screen for substances of non-therapeutic use prior to craving assessments

The above is a clinical trial exclusion criterion. Annotated with entity spans:
[Value: Positive] [Measurement: urine toxicology screen] for [Qualifier: substances of non-therapeutic use] [Temporal: prior to craving assessments]